Clinical trial inclusion criteria:
moderate to severe Crohn's Disease (basic HBI = 7) with stenosis

Annotated entities:
- Qualifier: "moderate to severe"
- Condition: "Crohn's Disease"
- Measurement: "basic HBI"
- Value: "= 7"
- Condition: "stenosis"